Clinical trial inclusion criterion:
Able to ambulate a few steps with or without an assistive device

Annotated entities:
- Condition: "Able to ambulate a few steps"
- Qualifier: "without an assistive device"
- Qualifier: "with assistive device"